下列有關全身麻醉的敘述，何者錯誤？
A. 惡性高溫是一種對麻醉過敏的反應，主要是因為鈣離子大量釋放到血液中造成
B. 全身麻醉中發生過敏性休克的機轉與IgE有關
C. 全身麻醉時會發生低體溫與高體溫
D. 全身麻醉時的低血壓要同時考慮心輸出量與血管阻力

正確答案：A. 惡性高溫是一種對麻醉過敏的反應，主要是因為鈣離子大量釋放到血液中造成